What is considered a reliable technique for the definitive cytogenetic diagnosis of Fanconi anemia homozygosity?

In the great majority of cases, DEB and MMC stressing are reliable techniques for the definitive cytogenetic diagnosis of FA homozygosity